¿Cuál de las siguientes creencias forma parte de los esquemas nucleares de un trastorno de personalidad esquizoide, según el modelo de la Terapia Cognitiva?
1. Soy mejor que los otros.
2. Los otros son tontos.
3. Ser controlado por otros es intolerable.
4. Necesito a la gente para sobrevivir.
5. Los otros no me compensan.

Respuesta correcta: 5. Los otros no me compensan.